Con respecto al coeficiente de distribución de un soluto entre dos líquidos parcialmente miscibles:
1. Por ser un cociente entre concentraciones de soluto en las dos fases, es independiente de la temperatura.
2. No depende de la cantidad total de soluto en ambas partes.
3. Es útil para determinar la masa molar del soluto.
4. Si una fase es agua y la otra un disolvente orgánico, suele utilizarse en química médica y ambiental para conocer la distribución de medicamentos y contaminantes entre estos dos tipos de medios.
5. Sólo tiene significado físico cuando las fases líquidas están en contacto a través de una membrana semipermeable.

Respuesta correcta: 4. Si una fase es agua y la otra un disolvente orgánico, suele utilizarse en química médica y ambiental para conocer la distribución de medicamentos y contaminantes entre estos dos tipos de medios.